use of Insulin, SGLT2-inhibitor, sulfonylurea derivate or a glinide within past 3 months

The above is a clinical trial exclusion criterion. Annotated with entity spans:
use of [Drug: Insulin], [Drug: SGLT2-inhibitor], [Drug: sulfonylurea derivate] or a [Drug: glinide] within [Temporal: past 3 months]